下列那些病人不宜使用triptans來治療偏頭痛？
A. 合併有心血管疾病
B. 典型的視覺預兆偏頭痛
C. 有持續10分鐘的感覺預兆的偏頭痛
D. 合併有憂鬱症的病人

正確答案：A. 合併有心血管疾病